Estradiol (E2) <= 3000 picogram/milliliter (pg/mL) at the human chorionic gonadotropin (HCG) triggering day (Day 0/Randomization)

The above is a clinical trial inclusion criterion. Annotated with entity spans:
[Measurement: Estradiol (E2)] [Value: <= 3000 picogram/milliliter (pg/mL)] [Temporal: at the human chorionic gonadotropin (HCG) triggering day] ([Reference_point: Day 0/Randomization])